Dementia or Mild cognitive impairment at baseline

The above is a clinical trial exclusion criterion. Annotated with entity spans:
[Condition: Dementia] or [Condition: Mild cognitive impairment] [Temporal: at baseline]